history of allergic disease likely to be stimulated by the vaccination

The above is a clinical trial exclusion criterion. Annotated with entity spans:
history of [Condition: allergic disease] likely to be [Qualifier: stimulated by the vaccination]